Clinical trial exclusion criterion:
Alpha fetoprotein > 50 ng/ml

Annotated entities:
- Measurement: "Alpha fetoprotein"
- Value: "> 50 ng/ml"